下列有關寄生蟲之敘述中，何者錯誤？
A. 瘧疾發作（paroxysm）之過程依序為：惡寒（chill）、發燒（fever）、發汗（sweat）
B. 三日瘧原蟲（Plasmodium malariae）較喜侵入成熟的紅血球中分裂增殖
C. 卵形瘧原蟲（Plasmodium ovale）之鑑定，常視患者血液抹片是否有帶狀型滋養體（band form
D. 在瘧疾流行地區，六個月以下的嬰兒常因為得自母體抗體的保護作用，甚少罹患瘧疾

正確答案：C. 卵形瘧原蟲（Plasmodium ovale）之鑑定，常視患者血液抹片是否有帶狀型滋養體（band form